Active alcohol or opioid substitution therapy

The above is a clinical trial exclusion criterion. Annotated with entity spans:
Active [Observation: alcohol] or [Procedure: opioid substitution therapy]